散光鏡片度數的記載 +2.0D sph with cyl -3.0D ax 90° 與下列何者是相當的？
A. -2.0D sph with cyl + 3.0D ax 180°
B. -2.0D sph with cyl - 3.0D ax 90°
C. -1.0D sph with cyl + 3.0D ax 180°
D. -1.0D sph with cyl - 3.0D ax 90°

正確答案：C. -1.0D sph with cyl + 3.0D ax 180°